Clinical trial exclusion criteria:
Any condition that prevents participation in the study, including pregnancy and other contraindications for Ventavis treatment (as listed in the current Ventavis Summary of Product Characteristics and patient package insert)

Annotated entities:
- Condition: "pregnancy"
- Condition: "contraindications"
- Procedure: "Ventavis treatment"
- Qualifier: "Ventavis Summary of Product Characteristics and patient package insert"